Clinical trial exclusion criterion:
allergy to metformin

Entity relations:
- AND("allergy", "metformin")